Clinical trial exclusion criterion:
Systematical inflammation

Annotated entities:
- Condition: "Systematical inflammation"